written informed consent of both parents

The above is a clinical trial inclusion criterion. Annotated with entity spans:
[Informed_consent: written informed consent of both parents]